Clinical trial inclusion criterion:
have a diagnosis of locally advanced or metastatic melanoma

Annotated entities:
- Condition: "melanoma"
- Qualifier: "metastatic"
- Qualifier: "locally advanced"